Clinical trial inclusion criterion:
Stable concomitant Disease Modifying Anti-Rheumatic Drugs (DMARDs)

Entity relations:
- Has_temporal("Disease Modifying Anti-Rheumatic Drugs (DMARDs)", "concomitant")
- Has_multiplier("Disease Modifying Anti-Rheumatic Drugs (DMARDs)", "Stable")